Clinical trial exclusion criterion:
Chronic pain syndrome defined as use of any analgesic medication on a daily or near-daily basis

Annotated entities:
- Condition: "Chronic pain syndrome"
- Drug: "analgesic medication"
- Qualifier: "any"
- Multiplier: "on a daily basis"
- Multiplier: "on a near-daily basis"